(1)Women who are pregnant and/or lactating; or women who intend to conceive within a year;

The above is a clinical trial exclusion criterion. Annotated with entity spans:
(1)[Person: Women] who are [Condition: pregnant] and/or [Observation: lactating]; or [Person: women] who [Observation: intend to conceive] [Temporal: within a year];